Clinical trial exclusion criterion:
Thyroid problems the PI deems them to be ineligible for

Annotated entities:
- Condition: "Thyroid problems"